Clinical trial exclusion criterion:
Patients minors

Annotated entities:
- Person: "minors"